La angiotensina II:
1. Se forma por acción de la renina sobre la angiotensina I.
2. Inhibe la secreción de aldosterona.
3. Inhibe la secreción de ADH.
4. Induce reabsorción renal de Na+.
5. Reduce la sed.

Respuesta correcta: 4. Induce reabsorción renal de Na+.